有關叢發性頭痛（cluster headache），以下何者為非？
A. 患者多為年輕女性
B. 發生時，易流淚及流鼻水
C. 吸入 100%純氧可緩解頭痛
D. 可用鋰鹽預防發作

正確答案：A. 患者多為年輕女性